依據 TNM 分期標準，有關大腸直腸癌的臨床分期之敘述，下列何者錯誤？
A. T2N0M0為第I期
B. T1N1M0為第II期
C. T3N2M0為第III期
D. T3N0M1為第IV期

正確答案：B. T1N1M0為第II期